Clinical trial exclusion criterion:
Implantation of a cardiac resynchronization therapy (CRT) device within 3 months or intent to implant a CRT.

Entity relations:
- AND("Implantation", "cardiac resynchronization therapy (CRT) device")
- AND("implant", "CRT")
- Has_mood("implant", "intent")
- Has_temporal("Implantation", "within 3 months")
- OR("Implantation", "implant")